肌上皮細胞（myoepithelial cells）不出現於下列何處？
A. 皮脂腺（sebaceous gland）
B. 腺（sweat gland）
C. 乳腺（mammary gland）
D. 唾液腺（salivary gland）

正確答案：A. 皮脂腺（sebaceous gland）